Clinical trial exclusion criterion:
Patients with supine systolic blood pressure (SBP) = 180 mm Hg, or diastolic blood pressure (DBP) = 110 mm Hg.

Annotated entities:
- Measurement: "systolic blood pressure"
- Qualifier: "supine"
- Measurement: "SBP"
- Value: "= 180 mm Hg"
- Measurement: "diastolic blood pressure"
- Measurement: "DBP"
- Value: "= 110 mm Hg"